Family history of congenital or hereditary immunodeficiency.

The above is a clinical trial exclusion criterion. Annotated with entity spans:
[Observation: Family history] of [Condition: congenital] or [Condition: hereditary immunodeficiency].